正常人體之血液分置入甲、乙兩管，同時分別灌入氣體使得兩者之二氧化碳分壓均為 46 mmHg，甲管氧分壓為100 mmHg，乙管氧分壓則為40 mmHg。下列敘述何者正確？
A. 甲、乙兩管內二氧化碳總含量相同
B. 甲管內碳醯胺基血紅素（carbaminohemoglobin）佔全部血紅素（hemoglobin）之比例比乙管低
C. 乙管血液之氣體組成近似於體動脈血（systemic arterial blood）
D. 造成甲、乙兩管內血紅素（hemoglobin）分子特性差異之主要原因為波爾效應（Bohr effect）

正確答案：B. 甲管內碳醯胺基血紅素（carbaminohemoglobin）佔全部血紅素（hemoglobin）之比例比乙管低